El óxido nítrico:
1. Se sintetiza a partir de metionina.
2. Activa la proteinquinasa dependiente de AMPc (PKA).
3. Se une a receptores acoplados a proteínas G (GPCR).
4. Induce relajación del endotelio vascular.
5. Se une a receptores con actividad proteína tirosina quinasa (PTK).

Respuesta correcta: 4. Induce relajación del endotelio vascular.